Clinical trial exclusion criterion:
WHO group II, III, IV, V PH

Entity relations:
- Has_value("WHO", "group II, III, IV, V")
- AND("PH", "WHO")